Clinical trial exclusion criterion:
1) preoperative diagnosis of delirium or dementia; 2) MMSE score of = 20 out of 30 on preoperative testing (more than mild cognitive impairment) or delirium on preoperative CAM testing; 3) language barriers that would preclude testing; 4) preoperative steroid use within 3 days of surgery; or 5) anticipation of postoperative intubation.

Annotated entities:
- Line: "1) preoperative diagnosis of delirium or dementia;"
- Line: "2) MMSE score of = 20 out of 30 on preoperative testing (more than mild cognitive impairment) or delirium on preoperative CAM testing;"
- Line: "3) language barriers that would preclude testing;"
- Line: "4) preoperative steroid use within 3 days of surgery;"
- Line: "5) anticipation of postoperative intubation."
- Condition: "delirium"
- Condition: "dementia"
- Temporal: "preoperative"
- Measurement: "MMSE score"
- Value: "= 20 out of 30"
- Temporal: "preoperative"
- Qualifier: "more than mild"
- Condition: "cognitive impairment"
- Condition: "delirium"
- Temporal: "preoperative"
- Procedure: "CAM testing"
- Observation: "language barriers"
- Temporal: "preoperative"
- Drug: "steroid"
- Temporal: "within 3 days of surgery"
- Reference_point: "surgery"
- Procedure: "surgery"
- Temporal: "postoperative"
- Procedure: "intubation"
- Mood: "anticipation"